Describe the mechanism of action of Lisocabtagene maraleucel.

Lisocabtagene maraleucel is an autologous, CD19-directed, chimeric antigen receptor (CAR) T-cell product.